Subjects were not to have had an abnormal diet or substantial changes in eating habits within 30 days prior to study initiation.

The above is a clinical trial exclusion criterion. Annotated with entity spans:
Subjects were [Negation: not] to have had an [Observation: abnormal diet] or [Qualifier: substantial] [Observation: changes in eating habits] [Temporal: within 30 days prior to study initiation].